What nerve is affected in Carpel Tunnel syndrome?

Carpel tunnel syndrome is a common compression neuropathy of the median nerve causing pain, numbness and functional dysfunction of the hand.